Clinical trial exclusion criterion:
Patients who received systemic anti-cancer treatment prior to the first dose of study drug within the following time frames:

Annotated entities:
- Procedure: "systemic anti-cancer treatment"
- Temporal: "prior to the first dose of study drug"
- Reference_point: "the first dose of study drug"
- Parsing_Error: "Patients who received systemic anti-cancer treatment prior to the first dose of study drug within the following time frames:"